Clinical trial exclusion criterion:
11. Patients with severe rheumatoid arthritis (with more than 20 persistently inflamed joints, or below lower normal limit blood albumin level, or evidence of bone and cartilage damage on x-ray, or inflammation in tissues other than joints) and other collagen vascular diseases.

Annotated entities:
- Parsing_Error: "11."
- Condition: "rheumatoid arthritis"
- Qualifier: "severe"
- Multiplier: "more than 20"
- Condition: "inflamed joints"
- Temporal: "persistently"
- Measurement: "blood albumin level"
- Value: "below lower normal limit"
- Condition: "bone and cartilage damage"
- Procedure: "x-ray"
- Condition: "inflammation in tissues other than joints"
- Condition: "collagen vascular diseases"